Clinical trial exclusion criterion:
Patients with hepatic artery chemoembolization within the last 6 months (one month if there are other sites of measurable disease)

Annotated entities:
- Procedure: "hepatic artery chemoembolization"
- Temporal: "within the last 6 months"
- Temporal: "one month"
- Observation: "other sites of measurable disease"